Un paciente acude a un servicio de urgencias hospitalarias presentando hematemesis franca. En la valoración inicial el paciente está pálido y sudoroso, tiene una frecuencia cardiaca de 110 latidos por minuto y una presión arterial sistólica de 98 mmHg. ¿Cuál de las siguientes acciones NO realizaría en la atención inicial a este paciente?
1. Asegurar una adecuada oxigenación del paciente.
2. Canalizar dos vías periféricas de grueso calibre.
3. Utilizar el hematocrito como índice de pérdida hemática.
4. Reponer la volemia con soluciones de cristaloides.
5. Colocar una sonda nasogástrica.

Respuesta correcta: 3. Utilizar el hematocrito como índice de pérdida hemática.